Secondary hypertension or malignant hypertension

The above is a clinical trial exclusion criterion. Annotated with entity spans:
[Condition: Secondary hypertension] or [Condition: malignant hypertension]